Clinical trial exclusion criteria:
Contraindication to bariatric surgery
Pregnancy
Affiliation of health care assurance
Psychiatric disorders

Annotated entities:
- Procedure: "bariatric surgery"
- Condition: "Contraindication"
- Condition: "Pregnancy"
- Observation: "Affiliation of health care assurance"
- Condition: "Psychiatric disorders"